下列何者不是人類腦部額葉（frontal lobe）病變常發生的症狀？
A. 原始反射（primitive reflex）的出現
B. 語言表達失常
C. 無方向感（right-left disorientation）
D. 失去動作的起始性（initiation）

正確答案：C. 無方向感（right-left disorientation）